Clinical trial inclusion criterion:
1. Be able to give valid informed consent

Annotated entities:
- Parsing_Error: "1."
- Non-query-able: "Be able to give valid informed consent"
- Post-eligibility: "Be able to give valid informed consent"